Clinical trial inclusion criterion:
Patients with a diagnosis of prostatic carcinoma requiring prostate surgery

Entity relations:
- AND("prostatic carcinoma", "prostate surgery")